Pre-existing uncontrolled diarrhea

The above is a clinical trial exclusion criterion. Annotated with entity spans:
Pre-existing [Condition: uncontrolled diarrhea]